Clinical trial exclusion criterion:
Women of childbearing potential (WOCP) who are not using at least one method of contraception.

Annotated entities:
- Pregnancy_considerations: "Women of childbearing potential (WOCP) who are not using at least one method of contraception"